Clinical trial inclusion criterion:
Male or female >40 and <70 years old.

Annotated entities:
- Person: "Male"
- Person: "female"
- Value: ">40 and <70 years"
- Person: "old"